當胞外鉀離子濃度升高，神經細胞的靜止膜電位會發生何種變化？
A. 去極化
B. 過極化
C. 變化不大
D. 先過極化然後去極化

正確答案：A. 去極化